Clinical trial exclusion criterion:
Hypersensitivity to, or disability to take immunosuppressive drugs.

Entity relations:
- AND("disability", "immunosuppressive drugs")
- AND("Hypersensitivity", "immunosuppressive drugs")
- OR("Hypersensitivity", "disability")